List selective estrogen receptor degraders.

Selective estrogen receptor degraders (SERD) are fulvestrant, RAD1901 and ARN-810. Fulvestrant is the only SERD approved for the treatment of breast cancer.